Evaluable Disease in the Phase I, and measurable disease in the Phase II

The above is a clinical trial inclusion criterion. Annotated with entity spans:
[Qualifier: Evaluable] [Condition: Disease] [Temporal: in the Phase I], and [Qualifier: measurable] disease [Temporal: in the Phase II]